Any condition or procedure that has compromised neurological control of the upper airway

The above is a clinical trial exclusion criterion. Annotated with entity spans:
[Non-query-able: Any condition or procedure that has compromised neurological control of the upper airway]